Clinical trial exclusion criterion:
Known allergy or hypersensitive reaction to dexmedetomidine

Entity relations:
- AND("allergy", "dexmedetomidine")
- OR("allergy", "hypersensitive")